Clinical trial inclusion criterion:
Patient over 18 years weighing between 65 and 85 Kg

Entity relations:
- Has_value("years", "over 18")
- Has_value("weighing", "between 65 and 85 Kg")